Patients undergoing a high tibial osteotomy (HTO)

The above is a clinical trial inclusion criterion. Annotated with entity spans:
Patients [Temporal: undergoing] a [Procedure: high tibial osteotomy (HTO)]